Un elemento de respuesta a las hormonas se define como
1. Una proteína transmembrana a la que se unen las hormonas esteroideas.
2. Una secuencia de DNA a la que se unen las hormonas esteroideas.
3. La región del receptor de una hormona esteroidea a la que se une la hormona.
4. La secuencia de DNA a la que se une un complejo específico hormona-receptor.

Respuesta correcta: 4. La secuencia de DNA a la que se une un complejo específico hormona-receptor.